Clinical trial exclusion criterion:
Current use of systemic steroids >20 mg QD prednisone (or equivalent)

Entity relations:
- Subsumes("systemic steroids", "prednisone")
- Has_multiplier("prednisone", ">20 mg QD")